Clinical trial inclusion criterion:
Intermediate risk:Gleason <or=6 & PSA<or=10 & Clinical Stage T2b OR Gleason=7 & PSA<or=10 & Clinical Stage T1b-T2b OR Gleason <or=6 & PSA > 10 & < or =20 & Clinical Stage T1b- T2b, Nx or NO, Mx or M0

Entity relations:
- Has_value("Clinical Stage", "T1b- T2b")
- Has_value("PSA", "> 10 & < or =20")
- Has_value("Gleason", "<or=6")
- Has_value("Clinical Stage", "T1b-T2b")
- Has_value("PSA", "<or=10")
- Has_value("Gleason", "=7")
- Has_value("Clinical Stage", "T2b")
- Has_value("PSA", "<or=10")
- Has_value("Gleason", "<or=6")
- Subsumes("Intermediate risk", "Gleason")
- Has_value("Clinical Stage", "Nx")
- Has_value("Clinical Stage", "Mx")
- Subsumes("Intermediate risk", "PSA")
- Subsumes("Intermediate risk", "Clinical Stage")
- OR("Nx", "NO")
- OR("Mx", "M0")
- OR("Gleason", "Gleason", "Gleason")
- OR("PSA", "Gleason", "Gleason")
- OR("Clinical Stage", "Gleason", "Gleason")